Capacity to give consent for study participation, after being adequately informed of the aims, benefits, risks, time and motion of the study.

The above is a clinical trial inclusion criterion. Annotated with entity spans:
[Non-query-able: Capacity to give consent for study participation, after being adequately informed of the aims, benefits, risks, time and motion of the study.]